Clinical trial inclusion criterion:
resection must have been macroscopically complete laterally,

Annotated entities:
- Condition: "resection"
- Qualifier: "macroscopically complete laterally"